Known severe peripheral vascular disease or major iliac arterial occlusive disease

The above is a clinical trial exclusion criterion. Annotated with entity spans:
Known [Qualifier: severe] [Condition: peripheral vascular disease] or [Qualifier: major] [Condition: iliac arterial occlusive disease]